En la biosíntesis de proteínas, durante el proceso de traducción tiene lugar el apareamiento de bases entre:
1. El RNA y el DNA.
2. El DNA y el RNA ribosómico.
3. El RNA de transferencia y el RNA ribosómico.
4. El RNA mensajero y el RNA de transferencia.
5. El RNA ribosómico 18S y el RNA ribosómico 5S.

Respuesta correcta: 4. El RNA mensajero y el RNA de transferencia.